Females undergoing Intra-Cytoplasmic Sperm Injection (ICSI) cycles

The above is a clinical trial inclusion criterion. Annotated with entity spans:
[Person: Females] [Temporal: undergoing] [Procedure: Intra-Cytoplasmic Sperm Injection (ICSI) cycles]